¿Cuál de estas representaciones gráficas emplearía para examinar la relación entre dos o más variables cuantitativas?
1. Diagrama de sectores.
2. Gráfico de dispersión.
3. Histograma.
4. Gráfico de cajas.
5. Diagrama de barras.

Respuesta correcta: 2. Gráfico de dispersión.